Clinical trial exclusion criterion:
Pulmonary abnormalities or breast x-ray abnormalities;

Annotated entities:
- Condition: "Pulmonary abnormalities"
- Procedure: "breast x-ray"
- Value: "abnormalities"